下列何種減肥藥是作用在腸胃道，可減少脂肪的吸收？
A. phentermine
B. topiramate
C. orlistat
D. lorcaserin

正確答案：C. orlistat